Clinical trial exclusion criterion:
severe valvular or left ventricular outflow obstruction disease needing intervention;

Annotated entities:
- Condition: "left ventricular outflow obstruction"
- Condition: "valvular disease"
- Qualifier: "severe"
- Procedure: "intervention"